Clinical trial inclusion criterion:
Informed and signed consent signed by the patient or his / her legal representative.

Annotated entities:
- Non-query-able: "Informed and signed consent signed by the patient or his / her legal representative"